Pediatric patients with deep dental decay in primary molars

The above is a clinical trial inclusion criterion. Annotated with entity spans:
[Person: Pediatric] patients with [Condition: deep dental decay] in [Qualifier: primary molars]